Clinical trial inclusion criterion:
6. CD4 cell counts >150 cells/μL (though likely most, if not all, will be >250 cells/μL).

Entity relations:
- Has_value("CD4 cell counts", ">150 cells/μL")
- Subsumes(">150 cells/μL", ">250 cells/μL")